Clinical diagnosis of acute coronary syndrome

The above is a clinical trial inclusion criterion. Annotated with entity spans:
Clinical diagnosis of [Condition: acute coronary syndrome]